Must sign informed consent

The above is a clinical trial inclusion criterion. Annotated with entity spans:
[Informed_consent: Must sign informed consent]